Clinical trial exclusion criteria:
Allergy to LA
Infection in or near insertion site of the peripheral nerve catheter
Anatomical abnormalities preventing successful peripheral catheter insertion
Habitual use of opioids
Pregnancy or breastfeeding (disproved by a negative pregnancy test before trial inclusion)

Annotated entities:
- Condition: "Allergy"
- Drug: "LA"
- Qualifier: "near insertion site"
- Qualifier: "in insertion site"
- Device: "peripheral nerve catheter"
- Condition: "Anatomical abnormalities"
- Qualifier: "successful"
- Mood: "preventing"
- Device: "peripheral catheter"
- Procedure: "insertion"
- Negation: "preventing"
- Drug: "opioids"
- Multiplier: "Habitual use"
- Condition: "Pregnancy"
- Observation: "breastfeeding"
- Value: "negative"
- Procedure: "pregnancy test"
- Temporal: "before trial inclusion"
- Reference_point: "trial inclusion"
- Negation: "disproved by"